Clinical trial inclusion criteria:
Age = 18 years of either gender
Written informed consent must be obtained before any intravitreal injection of bevacizumab is performed
Visual impairment predominantly due to abnormal new vessel ingrowth and/or macular edema. The presence of fluid (intraretinal, subretinal or sub-RPE) detected clinically or on the ocular coherence tomography.

Annotated entities:
- Person: "Age"
- Value: "= 18 years"
- Person: "either gender"
- Informed_consent: "Written informed consent must be obtained before any intravitreal injection of bevacizumab is performed"
- Condition: "Visual impairment"
- Condition: "abnormal new vessel ingrowth"
- Condition: "macular edema"
- Qualifier: "intraretinal"
- Qualifier: "subretinal"
- Qualifier: "sub-RPE"
- Procedure: "ocular coherence tomography"
- Condition: "fluid"